Clinical trial exclusion criterion:
Infectious pathologies evoluting and requiring antibiotherapy.

Entity relations:
- multi("requiring antibiotherapy", "antibiotherapy")
- Has_qualifier("Infectious pathologies", "evoluting")
- OR("evoluting", "requiring antibiotherapy")